El modelo transaccional o procesual del estrés de Lazarus y Folkman:
1. Se centra en las reacciones fisiológicas ante cualquier estímulo estresante.
2. Describe el síndrome general de adaptación.
3. Establece tres etapas: reacción, resistencia y agotamiento.
4. Concede gran importancia a los procesos cognitivos que median entre el estímulo estresante y la respuesta de estrés.
5. Describe los efectos negativos a largo plazo de la exposición prolongada al estrés.

Respuesta correcta: 4. Concede gran importancia a los procesos cognitivos que median entre el estímulo estresante y la respuesta de estrés.